下列何種用藥在經由肝臟（cytochrome p450 3A）代謝後會藉不可逆（irreversibly）方式抑制血小板上的 P2Y 接受體？
A. Dipyridamole
B. Clopidogrel
C. Heparin
D. Eptifibatide

正確答案：B. Clopidogrel